下列何者不參與心肌細胞之收縮？
A. 肌漿網（sarcoplasmic reticulum）
B. T 小管（T-tubules）
C. 肌間盤裡的間隙接合（gap junction of intercalated disc）
D. 胞橋小體（desmosomes）

正確答案：D. 胞橋小體（desmosomes）